因乳癌而實施乳房摘除手術後之復健，下列注意事項何者錯誤？
A. 手術範圍越大，肩關節活動度越容易受影響
B. 術後疼痛須立即作患側肩關節主動關節活動以解除症狀
C. 肩關節活動角度應逐漸增加
D. 傷口癒合後，肩活動角度無須特別限制

正確答案：B. 術後疼痛須立即作患側肩關節主動關節活動以解除症狀